Clinical trial exclusion criterion:
neurodevelopmental disorders (including Trisomy 21)

Entity relations:
- Subsumes("neurodevelopmental disorders", "Trisomy 21")